Which type of analysis does DeSeq2 perform?

DeSeq2 is a software for differential gene expression analysis of RNA sequencing data.